法洛氏四合症（tetralogy of Fallot）不包括下列何者？
A. 心室中隔缺損（ventricular septal defect）
B. 右心出路阻塞（right ventricular outflow tract obstruction）
C. 右心室肥厚（right ventricular hypertrophy）
D. 主動脈瓣狹窄（aortic stenosis）

正確答案：D. 主動脈瓣狹窄（aortic stenosis）